比較先天性巨結腸症（Hirschsprung disease, HD）和功能性便秘（Functional constipation, FC）各種症狀 出現之機率，下列敘述何者錯誤？
A. 大便失禁（Encopresis）：HD＞FC
B. 生⻑遲緩（Failure to thrive）：HD＞FC
C. 小腸結腸炎（Enterocolitis）：HD＞FC
D. 腹漲（Abdominal distention）：HD＞FC

正確答案：A. 大便失禁（Encopresis）：HD＞FC